84 歲男性病人，因間歇性跛行（intermittent claudication）求治；被診斷為右側第一薦椎神經根疾病（right S1 radiculopathy），該病人不可能出現的症狀及徵候是：
A. 膝反射消失
B. 下背痛
C. 無力站起
D. 大腿後側疼痛

正確答案：A. 膝反射消失